Clinical trial exclusion criterion:
History of malignancy of any organ system (other than localized basal cell carcinoma of the skin), treated or untreated, within the past 5 years, regardless of whether there is evidence of local recurrence or metastases.

Entity relations:
- Has_qualifier("malignancy", "any organ system")
- Has_temporal("malignancy", "History")
- Has_negation("localized basal cell carcinoma of the skin", "other than")
- AND("malignancy", "localized basal cell carcinoma of the skin")
- Has_qualifier("malignancy", "treated")
- Has_temporal("malignancy", "within the past 5 years")
- OR("treated", "untreated")